下列何者不屬於美國精神醫學會「精神疾患診斷及統計手冊第四版」有關妥瑞氏症（Tourette's disorder）診斷標準之要件？
A. 運動性抽搐（motor tics）
B. 語音性抽搐（vocal tics）
C. 抽搐發生頻率一日多次
D. 疾病發生需在 15 歲之前

正確答案：D. 疾病發生需在 15 歲之前